Clinical trial inclusion criterion:
Previous therapy with BBIT (basal insulin and at least once daily bolus insulin)

Entity relations:
- Subsumes("BBIT", "basal insulin and at least once daily bolus insulin")
- AND("therapy", "BBIT")
- Has_temporal("therapy", "Previous")